7. Known history of chronic viral hepatitis

The above is a clinical trial exclusion criterion. Annotated with entity spans:
[Parsing_Error: 7.] Known [Temporal: history] of [Temporal: chronic] [Condition: viral hepatitis]